Clinical trial inclusion criteria:
The treating physician has chosen Ventavis as a suitable long-term treatment for the patient
Patient with primary pulmonary hypertension (i.e. Idiopathic Pulmonary Arterial Hypertension or Familial Pulmonary Arterial Hypertension) and classified as NYHA functional class III (NYHA = New York Heart Association)
No prior treatment with Ventavis or other active treatments for primary pulmonary hypertension within 6 weeks of date of study inclusion (unless otherwise advised by Bayer Schering Pharma)

Annotated entities:
- Drug: "Ventavis"
- Multiplier: "long-term"
- Condition: "primary pulmonary hypertension"
- Condition: "Idiopathic Pulmonary Arterial Hypertension"
- Condition: "Familial Pulmonary Arterial Hypertension"
- Measurement: "NYHA functional class"
- Value: "III"
- Procedure: "treatment with Ventavis"
- Condition: "primary pulmonary hypertension"
- Procedure: "treatments"
- Qualifier: "for primary pulmonary hypertension"
- Temporal: "within 6 weeks of date of study inclusion"
- Negation: "No"